KPS score with 50-100 points;

The above is a clinical trial inclusion criterion. Annotated with entity spans:
[Measurement: KPS score] with [Value: 50-100 points];